Clinical trial exclusion criterion:
Radiotherapy within 3 weeks of the first dose of 852A

Annotated entities:
- Procedure: "Radiotherapy"
- Temporal: "within 3 weeks of the first dose"
- Drug: "852A"